Clinical trial exclusion criteria:
Ductal carcinoma in situ (DCIS; stage 0 cancer),
Advanced or distant metastatic stage,
Receiving any neoadjuvant therapy,
History of receiving any antibiotics within prior 3 months,
History of immunodeficiency,
Having a remote infection,
History of reaction to study antibiotics,
Denial of signing the consent form.

Annotated entities:
- Condition: "Ductal carcinoma in situ"
- Condition: "DCIS"
- Measurement: "stage"
- Condition: "cancer"
- Value: "0"
- Value: "distant metastatic"
- Measurement: "stage"
- Value: "Advanced metastatic"
- Procedure: "neoadjuvant therapy"
- Drug: "antibiotics"
- Temporal: "within prior 3 months"
- Temporal: "History"
- Condition: "immunodeficiency"
- Temporal: "History"
- Condition: "remote infection"
- Condition: "reaction"
- Temporal: "History"
- Drug: "study antibiotics"
- Negation: "Denial of"
- Informed_consent: "signing the consent form"